下列那一種方式不是處理肩難產的方法？
A. Woods corkscrew maneuver
B. Fundal pressure
C. McRoberts maneuver
D. Delivery of the posterior shoulder

正確答案：B. Fundal pressure